下列何者兼具控制腦下垂體與自主神經系統之功能？
A. Thalamus
B. Hypothalamus
C. Basal ganglia
D. Ventral tegmental area

正確答案：B. Hypothalamus